Clinical trial exclusion criterion:
Sleep apnea by polysomnography

Entity relations:
- AND("polysomnography", "Sleep apnea")